3. Previous episode of S. aureus bacteremia within 3 months.

The above is a clinical trial exclusion criterion. Annotated with entity spans:
3. Previous episode of [Condition: S. aureus bacteremia] [Temporal: within 3 months].